一位 60 歲男性病患，有長期糖尿病及高血壓，以口服藥物控制良好。因有 1 年肝功能異常求診，抽血檢查 GOT 值為 68 U/L，GPT 值為 104 U/L（兩項正常值均為 0~35 U/L），以下各診斷那一項最不可能？
A. 慢性 A 型肝炎
B. 慢性 B 型肝炎
C. 慢性 C 型肝炎
D. 脂肪肝

正確答案：A. 慢性 A 型肝炎